Clinical trial exclusion criterion:
Symptomatic bradycardia or second- or third-degree atrioventricular block without a pacemaker.

Entity relations:
- Has_negation("pacemaker", "without")
- Has_qualifier("atrioventricular block", "second- degree")
- AND("atrioventricular block", "pacemaker")
- OR("second- degree", "third-degree")
- OR("bradycardia", "atrioventricular block")